Clinical trial exclusion criterion:
3. Medications:

Annotated entities:
- Parsing_Error: "3."